Clinical trial inclusion criterion:
MADRS total score of 18 or higher

Entity relations:
- Has_value("MADRS", "score of 18 or higher")